某32歲無業女性有濫用鎮靜劑習慣超過5年，平均每日使用16毫克以上之flunitrazepam（俗稱FM-2），若此個案擬戒除此藥，下列何者正確？
A. flunitrazepam排除半衰期（elimination half-life）較長，故很快會出現戒斷症狀
B. 可用carbamazepine治療flunitrazepam戒斷症狀
C. 立即停止任何苯二氮平（benzodiazepine），或僅投以短效型（short-acting）為原則
D. 譫妄是flunitrazepam戒斷最常見症狀

正確答案：B. 可用carbamazepine治療flunitrazepam戒斷症狀